Clinical trial inclusion criterion:
planned sequential both-sided lower third molar extraction (split-mouth) with osteotomy (with or without upper molar extraction in local anesthesia)

Annotated entities:
- Mood: "planned"
- Qualifier: "sequential"
- Qualifier: "both-sided"
- Procedure: "lower third molar extraction"
- Qualifier: "split-mouth"
- Procedure: "osteotomy"
- Procedure: "upper molar extraction"
- Procedure: "local anesthesia"